Clinical trial inclusion criterion:
Hepatitis C recurrence defined by the presence of abnormal liver function test, positive HCV-RNA, histological signs of hepatitis C recurrence.

Entity relations:
- Has_multiplier("Hepatitis C", "recurrence")
- Has_value("HCV-RNA", "positive")
- Has_value("liver function test", "abnormal")
- Has_multiplier("hepatitis C", "recurrence")
- Subsumes("Hepatitis C", "liver function test")